El antiviral saquinavir que se utiliza contra el virus de la inmunodeficiencia humana es un inhibidor de la:
1. Fusión a la célula diana.
2. Transcriptasa inversa del virus.
3. Proteasa viral.
4. Integrasa viral.

Respuesta correcta: 3. Proteasa viral.